La aplicación de la terapia psicológica integrada de la esquizofrenia de Roder:
1. Mejora significativamente las variables cognitivas y conductuales tras el tratamiento.
2. Mejora exclusivamente las variables cognitivas.
3. Mejora las variables cognitivas significativamente mientras que sus efectos conductuales son inconsistentes.
4. Mejora inconsistentemente las variables cognitivas y conductuales.

Respuesta correcta: 3. Mejora las variables cognitivas significativamente mientras que sus efectos conductuales son inconsistentes.